Caudate nucleus主導下列何種功能？
A. 情緒控制
B. 動作執行
C. 調控自律神經
D. 憶能力

正確答案：B. 動作執行